La validación o verificación de la información es un paso esencial en el pensamiento crítico que le ayuda a evitar:
1. Hacer asunciones.
2. Omitir información pertinente.
3. Malinterpretar las situaciones.
4. Extraer conclusiones precipitadas o centrarse en una dirección equivocada.
5. Todas las respuestas anteriores son correctas.

Respuesta correcta: 5. Todas las respuestas anteriores son correctas.